Recreational drug use within 2 years before Screening

The above is a clinical trial exclusion criterion. Annotated with entity spans:
[Observation: Recreational drug use] [Temporal: within 2 years before Screening]